not fluent in English to be able to participate in the study process, including consent and phone interview

The above is a clinical trial exclusion criterion. Annotated with entity spans:
[Post-eligibility: not fluent in English to be able to participate in the study process, including consent and phone interview]